Clinical trial inclusion criterion:
Patient of appropriate caregiver able to give Informed Consent

Annotated entities:
- Informed_consent: "Patient of appropriate caregiver able to give Informed Consent"